Prior surgery at the index lumbar level.

The above is a clinical trial exclusion criterion. Annotated with entity spans:
[Temporal: Prior] [Procedure: surgery] at the [Qualifier: index lumbar level].